Which virus is Cidofovir (Vistide) indicated for?

Cidofovir is commonly used in the treatment of cytomegalovirus (CMV) infection and disease.